gastric malignancy, including adenocarcinoma and lymphoma,

The above is a clinical trial inclusion criterion. Annotated with entity spans:
[Condition: gastric malignancy], including [Condition: adenocarcinoma] and [Condition: lymphoma],